Seropositivity for human immunodeficiency virus (HIV)

The above is a clinical trial exclusion criterion. Annotated with entity spans:
[Value: Seropositivity] for [Measurement: human immunodeficiency virus] ([Measurement: HIV])